Clinical trial exclusion criterion:
Known Pulmonary Hypertension

Annotated entities:
- Condition: "Pulmonary Hypertension"